Clinical trial inclusion criterion:
Are assessed by the clinic staff as being at low risk for HIV infection

Annotated entities:
- Condition: "low risk"
- Condition: "HIV infection"
- Subjective_judgement: "low risk"
- Undefined_semantics: "low risk"